Clinical trial inclusion criterion:
Mild to moderate tear film dysfunction clinical diagnose

Annotated entities:
- Qualifier: "moderate"
- Qualifier: "Mild"
- Condition: "tear film dysfunction"